Clinical trial exclusion criteria:
Inability to provide written informed consent
Known history of prior intracranial bleeding
On treatment with a P2Y12 receptor antagonist (ticlopidine, clopidogrel, prasugrel, ticagrelor) in the prior 10 days
Known allergies to aspirin, ticagrelor or cangrelor
On treatment with oral anticoagulant
Treatment with glycoprotein IIb/IIIa inhibitors
Fibrinolytics within 24 hours
Active bleeding
High risk of bleeding
Known platelet count <80x106/mL
Known hemoglobin <10 g/dL
Intubated patients (prior to randomization)
Known creatinine clearance <30 mL/minute or on hemodialysis.
Known severe hepatic dysfunction
Patients with sick sinus syndrome (SSS) or high degree AV block without pacemaker protection
Current treatment with drugs interfering with CYP3A4 metabolism (to avoid interaction with ticagrelor): Ketoconazole, itraconazole, voriconazole, clarithromycin, nefazodone, ritonavir, saquinavir, nelfinavir, indinavir, atazanavir, and telithromizycin.
Pregnant or lactating females.

Annotated entities:
- Post-eligibility: "Inability to provide written informed consent"
- Condition: "intracranial bleeding"
- Qualifier: "prior"
- Drug: "P2Y12 receptor antagonist"
- Drug: "ticlopidine"
- Drug: "clopidogrel"
- Drug: "prasugrel"
- Drug: "ticagrelor"
- Temporal: "prior 10 days"
- Condition: "allergies"
- Drug: "aspirin"
- Drug: "ticagrelor"
- Drug: "cangrelor"
- Drug: "anticoagulant"
- Qualifier: "oral"
- Drug: "glycoprotein IIb/IIIa inhibitors"
- Procedure: "Fibrinolytics"
- Temporal: "within 24 hours"
- Condition: "Active bleeding"
- Qualifier: "High risk"
- Condition: "bleeding"
- Measurement: "platelet count"
- Value: "<80x106/mL"
- Measurement: "hemoglobin"
- Value: "<10 g/dL"
- Condition: "Intubated"
- Temporal: "prior to randomization"
- Reference_point: "randomization"
- Measurement: "creatinine clearance"
- Value: "<30 mL/minute"
- Procedure: "hemodialysis"
- Condition: "hepatic dysfunction"
- Qualifier: "severe"
- Condition: "sick sinus syndrome"
- Condition: "SSS"
- Condition: "AV block"
- Qualifier: "high degree"
- Procedure: "pacemaker"
- Negation: "without"
- Drug: "drugs"
- Condition: "CYP3A4 metabolism"
- Drug: "ticagrelor"
- Mood: "interfering with"
- Drug: "Ketoconazole"
- Non-query-able: "to avoid interaction with ticagrelor"
- Drug: "itraconazole"
- Drug: "voriconazole"
- Drug: "clarithromycin"
- Drug: "nefazodone"
- Drug: "ritonavir"
- Drug: "saquinavir"
- Drug: "nelfinavir"
- Drug: "indinavir"
- Drug: "atazanavir"
- Drug: "telithromizycin"
- Condition: "Pregnant"
- Condition: "lactating"
- Person: "females"